下列何種臨床疾病之病因被認為和 Endothelin-1 無關？
A. 高血壓
B. 心衰竭
C. 心肌梗塞
D. 肺動脈高壓症

正確答案：A. 高血壓